大腸桿菌DNA複製（DNA replication）的DNA聚合酶無法用於聚合酶鏈鎖反應（polymerase chain reaction;  PCR）的主要原因為何？
A. 熱穩定性（thermal stability）差
B. DNA模板（template）的選擇性差
C. 不具有3'核酸外切酶（3' exonuclease）活性
D. DNA合成的準確性不足

正確答案：A. 熱穩定性（thermal stability）差